Clinical trial exclusion criterion:
Endometriosis.

Annotated entities:
- Condition: "Endometriosis"